La fosforilación oxidativa mitocondrial está regulada por:
1. Hormonas esteroideas mitocondriales.
2. Apoptosis.
3. La termogenina.
4. El citocromo c.
5. La carga energética celular.

Respuesta correcta: 5. La carga energética celular.